Clinical trial exclusion criterion:
do not use tamoxifen or aromatase inhibitor

Annotated entities:
- Drug: "tamoxifen"
- Drug: "aromatase inhibitor"
- Negation: "not"